With evident severe atrophy of the alveolar ridge that could preclude an implant placement (e.g. sharp knife edge ridge)

The above is a clinical trial exclusion criterion. Annotated with entity spans:
[Non-query-able: With evident severe atrophy of the alveolar ridge that could preclude an implant placement (e.g. sharp knife edge ridge)]